Clinical trial inclusion criteria:
Generally healthy, postmenopausal woman who seeks treatment for hot flushes.
Meets 1 of the following: At least 12 months of spontaneous amenorrhea; At least 6 months of spontaneous amenorrhea with serum follicle-stimulating hormone (FSH) levels > 40 mIU/mL; At least 6 weeks postsurgical bilateral oophorectomy (with or without hysterectomy). Hysterectomized without bilateral oophorectomy and with serum FSH levels >40 mIU/mL.

Annotated entities:
- Condition: "healthy"
- Condition: "postmenopausal"
- Person: "woman"
- Condition: "hot flushes"
- Temporal: "At least 12 months"
- Condition: "spontaneous amenorrhea"
- Temporal: "At least 6 months"
- Condition: "spontaneous amenorrhea"
- Measurement: "serum follicle-stimulating hormone (FSH) levels"
- Value: "> 40 mIU/mL"
- Temporal: "At least 6 weeks postsurgical"
- Procedure: "bilateral oophorectomy"
- Procedure: "bilateral oophorectomy without hysterectomy"
- Procedure: "bilateral oophorectomy with hysterectomy"
- Condition: "Hysterectomized"
- Procedure: "bilateral oophorectomy"
- Negation: "without"
- Measurement: "serum FSH levels"
- Value: ">40 mIU/mL"
- Line: "At least 12 months of spontaneous amenorrhea"
- Multiplier: "Meets 1 of the following"